Smoking;

The above is a clinical trial exclusion criterion. Annotated with entity spans:
[Observation: Smoking];